Clinical trial inclusion criterion:
Maxilla and mandible

Entity relations:
- OR("Maxilla", "mandible")